Protocol-determined chemotherapy hydration

The above is a clinical trial exclusion criterion. Annotated with entity spans:
[Qualifier: Protocol-determined] [Procedure: chemotherapy hydration]